病人左側腮腺有顆腫瘤2公分大，經鏡檢發現有增生的小腺管、角化的 狀上皮細胞、肌上皮細胞、類似軟骨分化的細胞及有些類黏液的基質。有關該腫瘤的敘述，下列何者最不適當？
A. 診斷為多形性腺瘤（混合瘤）
B. 是來自多種胚層
C. 轉化為惡性的機率不高
D. 手術切除後可能會復發

正確答案：B. 是來自多種胚層